severe hypotension, shock, including cardiogenic shock

The above is a clinical trial exclusion criterion. Annotated with entity spans:
[Qualifier: severe] [Condition: hypotension], [Condition: shock], including [Condition: cardiogenic shock]